Clinical trial exclusion criterion:
Gastroesophageal Reflux Disease (GERD; active requiring significant intervention not including OTC medication)

Entity relations:
- Has_negation("OTC medication", "not")
- AND("significant intervention", "OTC medication")
- Subsumes("Gastroesophageal Reflux Disease", "GERD")